Clinical trial exclusion criterion:
Have Paget's disease, heart disease, uncontrolled hypertension, renal disease, or other concomitant conditions that prohibit participation in exercises, risedronate therapy, or use of CaD supplements.

Annotated entities:
- Condition: "Paget's disease"
- Condition: "heart disease"
- Condition: "uncontrolled hypertension"
- Condition: "renal disease"
- Condition: "other concomitant conditions that prohibit participation in exercises"
- Undefined_semantics: "other concomitant conditions that prohibit participation in exercises"
- Procedure: "risedronate therapy"
- Drug: "CaD supplements"